Clinical trial inclusion criterion:
BMI = 50 kg/m2

Entity relations:
- Has_value("BMI", "= 50 kg/m2")